下列有關風濕性心臟病合併僧帽瓣狹窄的敍述，何者錯誤？
A. 正常僧帽瓣的開口大小為 4～6 cm2，若<1 cm2為重度狹窄
B. 常合併心房纖維顫動
C. 常合併次發性肺高壓
D. 聽診常發現高音舒張期雜音（high pitched early diastolic murmur）

正確答案：D. 聽診常發現高音舒張期雜音（high pitched early diastolic murmur）